Nos remiten desde oftalmología a un hombre de 31 años que consultó por pérdida de visión y cefalea progresiva. En la exploración física se constata una hemianopsia temporal y en la resonancia magnética hipofisaria una tumoración de 35 x 30 x 20 mm que comprime quiasma y seno cavernoso. Los resultados del estudio funcional son cortisol 14 microg/dL, TSH 1,4 microU/mL, T4L 1,2 ng/dL, prolactina 480 microg/L (vn < 15), testosterona 160 ng/dL (vn 300-1200), FSH 1,2 U/L (vn 5-15) y LH 2 U/L (vn 3-15). ¿Cuál es el abordaje terapéutico inicial?:
1. Agonistas dopaminérgicos.
2. Cirugía transesfenoidal.
3. Radioterapia externa o radiocirugía.
4. Tratamiento del hipogonadismo hipogonadotropo con testosterona.

Respuesta correcta: 1. Agonistas dopaminérgicos.